要減少腦部腫瘤產生的水腫，下列何者是效果最佳且最常使用的腎上腺皮質素？
A. Betamethasone
B. Prednisolone
C. Dexamethasone
D. Triamcinolone

正確答案：C. Dexamethasone